Preoperative left ventricular ejection fraction < 30%, sick sinus syndrome, severe sinus bradycardia (< 50 beats per minute), or second-degree or above atrioventricular block without pacemaker;

The above is a clinical trial exclusion criterion. Annotated with entity spans:
[Temporal: Preoperative] [Measurement: left ventricular ejection fraction] [Value: < 30%], [Condition: sick sinus syndrome], [Qualifier: severe] [Condition: sinus bradycardia] ([Value: < 50 beats per minute]), or [Qualifier: second-degree or above] [Condition: atrioventricular block] [Negation: without] [Device: pacemaker];